Clinical trial exclusion criterion:
History of thrombocytopenia induced by heparin

Entity relations:
- AND("thrombocytopenia", "heparin")